Clinical trial exclusion criterion:
Subject with uncontrolled atrial fibrillation/flutter at screening (defined as ventricular response rate = 100 bpm)

Annotated entities:
- Condition: "atrial fibrillation"
- Condition: "atrial flutter"
- Qualifier: "uncontrolled"
- Temporal: "at screening"
- Measurement: "ventricular response rate"
- Value: "= 100 bpm"